Clinical trial inclusion criterion:
aged 18 to 40 years.

Annotated entities:
- Person: "aged"
- Value: "18 to 40 years"